Clinical trial exclusion criterion:
Concomitant use of strong CYP 3A inhibitors or inducers

Entity relations:
- OR("strong CYP 3A inhibitors", "strong CYP 3A inducers")